Heart failure

The above is a clinical trial exclusion criterion. Annotated with entity spans:
[Condition: Heart failure]